Evidence of concomitant infection on exam or gram stain (i.e. herpes, both bacteria and acanthamoeba on gram stain)

The above is a clinical trial exclusion criterion. Annotated with entity spans:
Evidence of [Condition: concomitant infection] on exam or gram stain (i.e. herpes, both bacteria and acanthamoeba on gram stain)